En la traducción de procariotas, el primer ARNt:
1. Se introduce en el sitio A.
2. Une un aminoácido metilado.
3. Va acompañado del factor IF2.
4. Se empareja con un codón de inicio UGA.
5. Une siempre serina.

Respuesta correcta: 3. Va acompañado del factor IF2.